Clinical trial inclusion criterion:
Subjects diagnosed of schizophrenia as defined by Diagnostic and Statistical Manual of Mental Disorders, 4th edition text revision or 5th edition (DSM-<U+2163>-TR or 5) criteria, and a history of illness for at least for 3 years prior to screening.

Entity relations:
- Has_qualifier("schizophrenia", "Diagnostic and Statistical Manual of Mental Disorders, 4th edition text revision or 5th edition (DSM-<U+2163>-TR or 5) criteria")
- Has_multiplier("history of illness", "for at least for 3 years")
- Has_temporal("history of illness", "prior to screening")
- Has_temporal("schizophrenia", "history of illness")